Clinical trial inclusion criterion:
unresectable synchronous metastases

Entity relations:
- Has_qualifier("metastases", "synchronous")
- Has_qualifier("metastases", "unresectable")